Clinical trial inclusion criterion:
COPD: dyspnea: progressive (worsens over time), increases with exertion, persistent; chronic cough (may appear sporadically and may be unproductive); chronic expectoration; the impact of risk factors in the medical history (Smoking, occupational dust pollutants and chemicals); widespread wheeze on auscultation of the chest and/or distant wheezing in the chest; family history of COPD; spirometric data confirming the presence of fixed bronchial obstruction.

Annotated entities:
- Condition: "dyspnea"
- Qualifier: "progressive"
- Qualifier: "worsens over time"
- Qualifier: "increases with exertion"
- Qualifier: "persistent"
- Condition: "chronic cough"
- Condition: "chronic expectoration"
- Condition: "Smoking"
- Condition: "risk factors"
- Condition: "occupational dust pollutants and chemicals"
- Condition: "wheeze on auscultation of the chest"
- Condition: "distant wheezing in the chest"
- Qualifier: "widespread"
- Observation: "family history"
- Condition: "COPD"
- Procedure: "spirometric"
- Condition: "fixed bronchial obstruction"
- Condition: "COPD"